Clinical trial inclusion criterion:
Systolic blood pressure >=160 mm Hg OR a diastolic blood pressure of >=110 mm Hg measured twice more than 15 minutes apart

Entity relations:
- Has_value("Systolic blood pressure", ">=160 mm Hg")
- Has_value("diastolic blood pressure", ">=110 mm Hg")
- OR("Systolic blood pressure", "diastolic blood pressure")